Clinical trial inclusion criterion:
At least one episode of AF must be documented during the prior year by any kind of ECG recording.

Annotated entities:
- Multiplier: "At least one"
- Condition: "episode"
- Condition: "AF"
- Temporal: "prior year"
- Measurement: "ECG"